一位 60 歲男性病人為慢性 C 型肝炎相關肝硬化患者，過去並無其他特殊疾病。影像學檢查發現肝左葉有一 3 公分典型肝癌病灶，但並無肝外轉移現象。血清胎兒蛋白為 500 ng/mL，Child-Pugh 分類為 C，且病人有大量腹水情形，你最優先考慮下列何種治療？
A. 荷爾蒙治療
B. 外科手術切除
C. 酒精注射治療
D. 肝臟移植

正確答案：D. 肝臟移植